下列何者不是腎上腺皮質素的副作用？
A. 骨質疏鬆
B. 免疫抑制
C. 肌病變（myopathy）
D. 黑色素沈積

正確答案：D. 黑色素沈積